type 2 diabetes

The above is a clinical trial inclusion criterion. Annotated with entity spans:
[Condition: type 2 diabetes]